Clinical trial exclusion criterion:
presence of contraindications, current or past allergic or adverse reaction, or known sensitivity to cannabinoid-like substances (dronabinol/marijuana/cannabis/THC, cannabinoid oil, sesame oil, gelatin, glycerin, and titanium dioxide)

Entity relations:
- Subsumes("cannabinoid-like substances", "dronabinol")
- Has_temporal("allergic reaction", "current")
- AND("contraindications", "cannabinoid-like substances")
- AND("allergic reaction", "adverse reaction")
- OR("current", "past")
- OR("dronabinol", "glycerin", "gelatin", "sesame oil", "cannabinoid oil", "THC", "cannabis", "marijuana", "titanium dioxide")
- OR("contraindications", "allergic reaction", "sensitivity")